12. Heart rate <50 at time of screening

The above is a clinical trial exclusion criterion. Annotated with entity spans:
12. [Measurement: Heart rate] [Value: <50] [Temporal: at time of screening]